Patient is unable to perform exercise testing.

The above is a clinical trial exclusion criterion. Annotated with entity spans:
[Post-eligibility: Patient is unable to perform exercise testing].